Clinical trial exclusion criteria:
Acute coronary syndrome within 1 month
Heart failure NYHA III to IV
Contraindication to Aspirin
On anticoagulant therapy
Emergent surgery
Cardiac surgery
High bleeding risk surgeries, e.g., Intra-cranial surgery, Intra-spinal surgery, Retinal surgery
Pregnancy or breast-feeding
Life expectancy less than 1year

Annotated entities:
- Condition: "Acute coronary syndrome"
- Temporal: "within 1 month"
- Condition: "Heart failure"
- Measurement: "NYHA"
- Value: "III to IV"
- Condition: "Contraindication"
- Drug: "Aspirin"
- Procedure: "anticoagulant therapy"
- Procedure: "Emergent surgery"
- Procedure: "Cardiac surgery"
- Condition: "High bleeding risk surgeries"
- Condition: "Intra-cranial surgery"
- Condition: "Intra-spinal surgery"
- Condition: "Retinal surgery"
- Condition: "Pregnancy"
- Condition: "breast-feeding"
- Observation: "Life expectancy"
- Value: "less than 1year"